王教授正進行精子的研究，需要徵求自願之受試者，提供活動力好的精子，下列何者是最合適的受試者？
A. 王教授的學生
B. 精神病病患
C. 10-15 歲的青少年
D. 成年男子

正確答案：D. 成年男子